Clinical trial inclusion criterion:
With moderate/good ECOG health rating (PS): 0-1 score.

Entity relations:
- Subsumes("moderate/good", "0-1 score")
- Has_value("ECOG health rating (PS)", "moderate/good")